下列何者不屬於屈戌關節（hinge joint）？
A. 肩關節（Shoulder joint）
B. 踝關節（Ankle joint）
C. 肘關節（Elbow joint）
D. 指間關節（Interphalangeal joint）

正確答案：A. 肩關節（Shoulder joint）